下列何者為泌尿生殖膈的一部分？
A. 梨狀肌
B. 提肛肌
C. 會陰深橫肌
D. 尿道海綿體肌

正確答案：C. 會陰深橫肌